List radioprotection agents.

Amifostine
CAPE
Melanin
Melatonin
Metformin
Tea polyphenols 
alpha-2-macroglobulin